Guillain-Barré syndrome within eight weeks of a previous influenza vaccine

The above is a clinical trial exclusion criterion. Annotated with entity spans:
[Condition: Guillain-Barré syndrome] [Temporal: within eight weeks of a previous influenza vaccine]